Clinical trial exclusion criterion:
History of cardiovascular disease;

Annotated entities:
- Condition: "cardiovascular disease"
- Temporal: "History"